Clinical trial exclusion criterion:
Conversion to laparotomy

Entity relations:
- AND("Conversion to", "laparotomy")